下列何者為 DNA 肝炎病毒？
A. A 型
B. B 型
C. C 型
D. D 型

正確答案：B. B 型